下列何者是哺乳動物用來產熱的內生性去偶合劑（Endogenous uncoupling agent）？
A. 2,4-Dinitrophenol
B. Thermogenin
C. Thioredoxin
D. Cytochrome c

正確答案：B. Thermogenin